關於subcutaneous mycoses及其致病原之關聯，下列何者正確？
A. Sporotrichosis-Chaetomium spp.
B. Chromoblastomycosis- Madurella spp.
C. Eumycotic mycetoma-Aspergillus nidulans
D. Subcutaneous zygomycosis-Sporothrix schenckii

正確答案：C. Eumycotic mycetoma-Aspergillus nidulans